Clinical trial inclusion criterion:
Subjects who voluntarily consented, after listening enough explanation for this study and investigational product.

Annotated entities:
- Informed_consent: "Subjects who voluntarily consented, after listening enough explanation for this study and investigational product."